關於羊搔癢症傳染性蛋白質（scrapie-like prion protein, PrPSC）的特性，下列何者錯誤？
A. 是由基因突變所產生
B. 對福馬林有抗性
C. 能抵抗80oC高溫
D. 能抵抗紫外線

正確答案：A. 是由基因突變所產生